El señor L. R. es portador de una colostomía. ¿Cuál de las siguientes recomendaciones sobre actividades de la vida diaria es adecuada?:
1. Deberá evitar bañarse, ni con bolsa ni sin ella.
2. No puede realizar actividades deportivas.
3. No puede llevar faja encima de la bolsa.
4. Conviene que beba abundante líquido para evitar la deshidratación.
5. Deberá evitar las relaciones sexuales que impliquen contacto con la zona del estoma.

Respuesta correcta: 3. No puede llevar faja encima de la bolsa.